Clinical trial exclusion criterion:
Subject in an exclusion period from another study,

Annotated entities:
- Context_Error: "Subject in an exclusion period from another study,"
- Non-query-able: "Subject in an exclusion period from another study,"